Clinical trial inclusion criterion:
Participants having H. pylori related chronic gastritis with/without peptic ulcers who are aged greater than 20 years old and are willing to received eradication therapy.

Entity relations:
- Has_mood("eradication therapy", "willing to received")
- Has_value("aged", "greater than 20 years old")
- Has_qualifier("chronic gastritis", "H. pylori related")